2. Has a diagnosis of WHO Group 1 PAH.

The above is a clinical trial inclusion criterion. Annotated with entity spans:
[Parsing_Error: 2.] Has a diagnosis of [Measurement: WHO Group] [Value: 1] [Condition: PAH].